一對 35 歲不孕夫妻求診，經檢驗結果，妻：月經第 3 天 FSH：15 mIU/mL，E2：50 pg/mL，下列敘述何者最適當？
A. 為卵巢早期衰竭，需卵子捐贈
B. 為多囊性卵巢囊腫，需刺激排卵
C. 月經第 9 天安排 clomiphene citrate challenge test
D. 需荷爾蒙療法

正確答案：C. 月經第 9 天安排 clomiphene citrate challenge test